Clinical trial exclusion criterion:
Score greater than "0" on the Ocular Pain Assessment in the study eye at Screening

Entity relations:
- Has_value("Ocular Pain Assessment", "greater than "0"")
- Has_temporal("Ocular Pain Assessment", "at Screening")